下列何者並非後天免疫缺乏症候群（AIDS）之特性？
A. 由 Human T cell leukemia virus, type I 侵犯人類免疫系統
B. 容易引起卡氏肺囊蟲肺炎（Pneumocystis carinii pneumonia）
C. 容易發生在靜脈注射之毒癮者
D. 曾被稱為「廿世紀之黑死病」

正確答案：A. 由 Human T cell leukemia virus, type I 侵犯人類免疫系統